¿Cuál de estas afirmaciones es correcta?:
1. Cuanto menor es la varianza de la distribución muestral del estimador, mayor es la eficiencia.
2. Cuanto mayor es la varianza de la distribución muestral del estimador, mayor es la eficiencia.
3. Cuanto mayor es la varianza de la distribución muestral del estimador, mayor es la eficacia.
4. Cuanto menor es la varianza de la distribución muestral del estimador, menor es la eficiencia.

Respuesta correcta: 1. Cuanto menor es la varianza de la distribución muestral del estimador, mayor es la eficiencia.